Clinical trial exclusion criterion:
5. The ulcer has > 50% slough, significant necrotic tissue, bone, tendon, or capsule exposure or avascular ulcer beds

Entity relations:
- AND("ulcer", "slough")
- Has_value("slough", "> 50%")
- OR("necrotic tissue", "bone exposure", "capsule exposure", "avascular ulcer beds", "tendon exposure")